對於 acquired immunodeficiency syndrome（AIDS）的敘述，何者有誤？
A. 致病源是 HIV（human immunodeficiency virus）
B. 感染 HIV 就是 AIDS
C. AIDS 病人常有 tuberculosis 感染
D. Kaposi's sarcoma 可出現在 AIDS 病人身上

正確答案：B. 感染 HIV 就是 AIDS